要評估病患是否無月經（amenorrhea），下列那一項檢查不是必要的？
A. 小便驗孕
B. 診斷性腹腔鏡
C. 超音波檢查
D. 抽血驗相關 hormone（TSH, prolactin, FSH）

正確答案：B. 診斷性腹腔鏡